Cardiac MRI T2* <10ms;

The above is a clinical trial exclusion criterion. Annotated with entity spans:
[Measurement: Cardiac MRI T2*] [Value: <10ms];